Clinical trial exclusion criterion:
LVEF < 40%

Annotated entities:
- Measurement: "LVEF"
- Value: "< 40%"